Clinical trial exclusion criterion:
Active intake of toxic amounts of alcohol or recreational drugs.

Annotated entities:
- Condition: "alcohol"
- Multiplier: "toxic amounts"
- Undefined_semantics: "toxic amounts"
- Condition: "recreational drugs"
- Temporal: "Active intake"